Clinical trial inclusion criteria:
histologically confirmed metastatic cancer that is not amenable to surgery or radiation therapy with curative intent
measurable lesion by CT or other techniques according to RECIST

Annotated entities:
- Condition: "metastatic cancer"
- Measurement: "histologically"
- Value: "confirmed"
- Procedure: "radiation therapy"
- Procedure: "surgery"
- Qualifier: "not amenable"
- Procedure: "CT"
- Condition: "measurable lesion"